Clinical trial exclusion criterion:
Patients whose parents refuse to consent.

Annotated entities:
- Non-query-able: "Patients whose parents refuse to consent."